Clinically suspected scrub typhus: defined as acute undifferentiated fever with no clear focus of infection and negative malaria blood smear and/or negative malaria RDT. Patients may have one, none, or a combination of other clinical findings such as eschar, rash, lymphadenopathy, headache, myalgia, cough, nausea and abdominal discomfort.

The above is a clinical trial inclusion criterion. Annotated with entity spans:
Clinically suspected [Condition: scrub typhus]: defined as [Condition: acute undifferentiated fever] with [Negation: no clear] [Condition: focus of infection] and [Value: negative] [Measurement: malaria blood smear] and/or [Value: negative] [Measurement: malaria RDT]. Patients may have [Multiplier: one], [Multiplier: none], or [Multiplier: a combination of] other clinical findings such as [Condition: eschar], [Condition: rash], [Condition: lymphadenopathy], [Condition: headache], [Condition: myalgia], [Condition: cough], [Condition: nausea] and [Condition: abdominal discomfort].